性別主流化意涵，下列何者錯誤？
A. 將男女議題當成一種流行
B. 國家在政策制訂時，需同時考量對性別的影響與兩性共同參與
C. 婦女健康需要考量婦女需求與性別平等教育
D. 國家應設婦女專責單位

正確答案：A. 將男女議題當成一種流行